Chronic obstructive pulmonary disease

The above is a clinical trial exclusion criterion. Annotated with entity spans:
[Multiplier: Chronic] [Condition: obstructive pulmonary disease]